Clinical trial inclusion criterion:
Ability to provide diagnostic reports

Annotated entities:
- Non-query-able: "Ability to provide diagnostic reports"